Clinical trial exclusion criterion:
Inability to attend follow-up appointments

Annotated entities:
- Observation: "Inability to attend follow-up appointments"